Has undergone corneal refractive surgery.

The above is a clinical trial exclusion criterion. Annotated with entity spans:
Has undergone [Procedure: corneal refractive surgery].